Immunosuppression with tacrolimus and/or mycophenolate (Prednisone use is allowed at low dose, ≤10 mg/d).

The above is a clinical trial inclusion criterion. Annotated with entity spans:
[Procedure: Immunosuppression] with [Drug: tacrolimus] and/or [Drug: mycophenolate] ([Drug: Prednisone] use is allowed at [Multiplier: low dose], [Value: ≤10 mg/d]).